Clinical trial inclusion criterion:
9. No pain(including dysmenorrhea) or drug use (e.g., antipyretics,sleeping pills) within the last month

Annotated entities:
- Negation: "No"
- Condition: "pain"
- Temporal: "last month"
- Condition: "dysmenorrhea"
- Drug: "drug"
- Non-query-able: "antipyretics"